Clinical trial inclusion criterion:
History of allergic rhinitis

Annotated entities:
- Condition: "allergic rhinitis"